medical thoracoscopy cannot be performed within 48 hours;

The above is a clinical trial exclusion criterion. Annotated with entity spans:
[Procedure: medical thoracoscopy] [Mood: cannot be performed] [Temporal: within 48 hours];